Clinical trial exclusion criterion:
Local infection

Annotated entities:
- Condition: "Local infection"